目前要確實診斷支氣管擴張症（bronchiectasis），最佳的檢查項目為：
A. 胸部 X 光片
B. 胸部高解析度電腦斷層（high resolution computed tomography of chest）
C. 支氣管造影術（bronchography）
D. 支氣管鏡檢（bronchoscopy）

正確答案：B. 胸部高解析度電腦斷層（high resolution computed tomography of chest）